Clinical trial exclusion criterion:
4. Incapable of completing bowel preparation，such as dysphagia, allergy to purgatives, or impaired mental status, etc.

Annotated entities:
- Parsing_Error: "4."
- Condition: "Incapable of completing bowel preparation"
- Condition: "dysphagia"
- Condition: "allergy"
- Drug: "purgatives"
- Condition: "impaired mental status"